2. Unable to consent to the study.

The above is a clinical trial exclusion criterion. Annotated with entity spans:
2. [Post-eligibility: Unable to consent to the study.]